History of epilepsy

The above is a clinical trial exclusion criterion. Annotated with entity spans:
History of [Condition: epilepsy]